下列何者是細胞運送物質通過細胞膜之促進性擴散作用（facilitated diffusion）的特性？
A. 受到溶質濃度梯度的驅動
B. 需要 ATP 的驅動
C. 通常是一種吸能的（endergonic）反應
D. 通常是一種不可逆的反應

正確答案：A. 受到溶質濃度梯度的驅動